Clinical trial exclusion criterion:
Suspicion of chorioamnionitis

Annotated entities:
- Mood: "Suspicion of"
- Condition: "chorioamnionitis"